一位病人因一氧化碳血紅素濃度升高而造成注意力減退。下列何種情況可造成此現象？
A. 用含有氯化甲烷（methylene chloride）的溶劑清洗油漬
B. 利用 1,1,1-三氯乙烷（1,1,1-trichloroethane, methyl chloroform）來清潔鋁製品
C. 在電子零件工廠中經皮膚慢性暴露於乙二醇甲醚（ethylene glycol methyl ether）
D. 吸入含有 carbonyl chloride 或 carbonyl bromide 的農藥

正確答案：A. 用含有氯化甲烷（methylene chloride）的溶劑清洗油漬